Clinical trial exclusion criterion:
Acetylsalicyclic acid (ASA) treatment >1g/day or regular use of Non steroidal anti-inflammatory drug (NSAIDs)

Annotated entities:
- Procedure: "Acetylsalicyclic acid (ASA) treatment"
- Value: ">1g/day"
- Drug: "Non steroidal anti-inflammatory drug (NSAIDs)"